Admissible medical/surgical history

The above is a clinical trial inclusion criterion. Annotated with entity spans:
[Qualifier: Admissible] [Temporal: medical]/[Temporal: surgical history]